Un paciente conocido por su mal carácter y actitud poco amable acudió a su consulta del centro de atención primaria hace unos días por un cuadro compatible con una bronquitis aguda. Tras la correspondiente evaluación, usted prescribió amoxicilina-clavulánico. El paciente acude de nuevo al segundo día por falta de mejora. A la exploración, no encuentra datos que hagan replantear el diagnóstico pero evidencia un exantema maculopapuloso difuso y observa que en la historia del paciente constaba el antecedente de alergia a la penicilina, que no había apreciado en la visita anterior. ¿Cuál cree que es la actitud más adecuada?
1. Comentarle al paciente que el tratamiento no parece haber sido efectivo y cambiar el antibiótico, evitando más comentarios que puedan comprometerle. Ofrecerle un nuevo control en pocos días.
2. Comentarle al paciente que el tratamiento de la bronquitis puede ser fundamentalmente sintomático y que los antibióticos no necesariamente son efectivos por lo que, dada la evolución, lo más aconsejable es suspender la amoxicilina-clavulánico e iniciar tratamiento sintomático, con nuevo control en pocos días.
3. Comentar que la presencia del exantema puede ser un efecto adverso de la medicación pues la amoxicilina-clavulánico, que no es lo mismo que la penicilina, puede en ocasiones tener reacciones cruzadas con la misma y que es mejor suspender toda medicación y ver evolución. Ofrecerle un nuevo control en pocos días.
4. Comentar que la presencia del exantema puede ser un afecto adverso de la medicación pues la amoxicilina-clavulánico forma parte de la familia de las penicilinas y que usted, en la anterior visita no se percató de que el paciente era alérgico a la misma. Suspenderla en consecuencia, pedir excusas, proponer un tratamiento sintomático y ofrecerle un nuevo control en pocos días.

Respuesta correcta: 4. Comentar que la presencia del exantema puede ser un afecto adverso de la medicación pues la amoxicilina-clavulánico forma parte de la familia de las penicilinas y que usted, en la anterior visita no se percató de que el paciente era alérgico a la misma. Suspenderla en consecuencia, pedir excusas, proponer un tratamiento sintomático y ofrecerle un nuevo control en pocos días.